下列有關傷寒（typhoid fever）及其病原菌的敘述，何者錯誤？
A. 傷寒桿菌（Salmonella typhi）可在人體的吞噬細胞內存活並繁殖
B. 病人的糞便檢體在發病第一週細菌培養常呈陽性結果
C. 傷寒帶原者，細菌多潛伏於膽囊
D. 菌體的Vi莢膜多	體（Vi capsular polysaccharides）可以作為疫苗

正確答案：B. 病人的糞便檢體在發病第一週細菌培養常呈陽性結果